一位 55 歲男性病人，突然發生右側肢體無力，小便失禁，經診斷為梗塞性腦中風。經過兩個月後，右上肢恢復到幾乎正常，但右下肢仍明顯無力，在診斷上最可能是那一條血管梗塞？
A. 前腦動脈（anterior cerebral artery）
B. 內頸動脈（internal carotid artery）
C. 基底動脈（basilar artery）
D. 中腦動脈（middle cerebral artery）

正確答案：A. 前腦動脈（anterior cerebral artery）